bupropion

The above is a clinical trial exclusion criterion. Annotated with entity spans:
[Drug: bupropion]